Clinical trial exclusion criterion:
no positive pregnancy test or breast feeding at screening

Entity relations:
- Has_value("pregnancy test", "positive")
- Has_temporal("pregnancy test", "at screening")
- OR("pregnancy test", "breast feeding")